遇緊急狀況時，腎上腺素（epinephrine）分泌增加，調控肝臟及骨骼肌的醣類代謝以提升血糖及骨骼肌運動，下列相關敘述何者錯誤？
A. 增加骨骼肌的肝醣分解（glycogenolysis）
B. 增加骨骼肌的糖解作用（glycolysis）
C. 增加肝臟的糖解作用（glycolysis）
D. 增加肝臟的糖質新生作用（gluconeogenesis）

正確答案：C. 增加肝臟的糖解作用（glycolysis）